下列有關 Morphine 藥理作用之描述，何者錯誤？
A. Morphine 會減少胃酸的分泌作用
B. 老年人對於 Morphine 所產生的鎮靜作用較年輕人敏感
C. Morphine 過量中毒時，可以利用瞳孔放大（Mydriasis）來判斷
D. Morphine 會促進 prolactin 的釋放

正確答案：C. Morphine 過量中毒時，可以利用瞳孔放大（Mydriasis）來判斷